下列關於流行性感冒病毒（Influenza virus）的抗原大變異（antigenic shift）之敘述，何者錯誤？
A. 是指不同病毒株之各段 RNA 基因體間的交換所造成的變異
B. 又稱為基因重組（genetic reassortment）
C. 是造成流行性感冒病毒世界性大流行（pandemic）的主要原因
D. 可見於 A 型及 B 型流行性感冒病毒

正確答案：D. 可見於 A 型及 B 型流行性感冒病毒